Clinical trial inclusion criterion:
Be conscious and able to comply with study procedures.

Annotated entities:
- Non-query-able: "Be conscious and able to comply with study procedures."